Clinical trial exclusion criterion:
Patients who'd had previous gastric surgery

Annotated entities:
- Procedure: "gastric surgery"
- Temporal: "previous"